Clinical trial inclusion criteria:
pregnant women in 30 to 32 weeks of gestation, with positive HBsAg and HBeAg,serum viral load above 8log10 copies per mL

Annotated entities:
- Condition: "pregnant"
- Person: "women"
- Value: "30 to 32 weeks"
- Measurement: "gestation"
- Measurement: "HBsAg"
- Measurement: "HBeAg"
- Value: "positive"
- Measurement: "serum viral load"
- Value: "above 8log10 copies per mL"